Clinical trial exclusion criterion:
Advanced renal impairment

Annotated entities:
- Condition: "Advanced renal impairment"